Clinical trial inclusion criterion:
Diagnosis of schizophrenia or schizoaffective disorder

Entity relations:
- OR("schizophrenia", "schizoaffective disorder")